Non-smoker for one year or more

The above is a clinical trial inclusion criterion. Annotated with entity spans:
[Negation: Non]-[Condition: smoker] [Temporal: for one year or more]